Clinical trial exclusion criterion:
Pregnant or breast feeding women

Entity relations:
- OR("Pregnant", "breast feeding")